Provision of written informed consent (by patient or appropriate designee according to local regulations) prior to any study specific procedures.

The above is a clinical trial inclusion criterion. Annotated with entity spans:
[Post-eligibility: Provision of written informed consent (by patient or appropriate designee according to local regulations) prior to any study specific procedures].